在抗原受器基因重組（antigen receptor gene rearrangement）時，N-核苷酸添加（N-nucleotide addition）多變方式 （diversity）於下列那一種重組時，其發生之機會為最低？
A. 抗體重鏈基因（Ig heavy chain gene）
B. 抗體輕鏈基因（Ig light chain gene）
C. T細胞受器α-鏈基因（TCR α-chain gene）
D. T細胞受器β-鏈基因（TCR β-chain gene）

正確答案：B. 抗體輕鏈基因（Ig light chain gene）